¿Cuál de las siguientes familias estructurales de fármacos actúan como agentes neurolépticos?
1. Benzotiazepinas (diltiazem).
2. Butirofenonas (haloperidol).
3. Fenilpiperidinas (petidina).
4. Ariloxipropanolaminas (atenolol).
5. 1,4-dihidropiridinas (nifedipina).

Respuesta correcta: 2. Butirofenonas (haloperidol).